Patients on current anticoagulant therapy

The above is a clinical trial exclusion criterion. Annotated with entity spans:
Patients on [Temporal: current] [Procedure: anticoagulant therapy]